Name a selective NK3R agonist.

Senktide  is a highly potent and selective NK3R agonist.